Clinical trial exclusion criterion:
Immunosuppressive therapy or renal dialysis (current or planned within the next 6 months).

Annotated entities:
- Procedure: "Immunosuppressive therapy"
- Condition: "renal dialysis"
- Mood: "current"
- Mood: "planned"
- Temporal: "within the next 6 months"
- Reference_point: "the next 6 months"